亞急性肉芽腫性甲狀腺炎（subacute granulomatous thyroiditis）之致病機轉尚未完全清楚，但是目前認為此疾病最可能是由下列何種感染所引發的？
A. 細菌感染（bacterial infection）
B. 黴菌感染（fungal infection）
C. 病毒感染（viral infection）
D. 結核菌感染（tuberculosis）

正確答案：C. 病毒感染（viral infection）